antibiotic use in the last 7 days

The above is a clinical trial exclusion criterion. Annotated with entity spans:
[Drug: antibiotic] use in the [Temporal: last 7 days]